Chronic respiratory diseases;

The above is a clinical trial exclusion criterion. Annotated with entity spans:
[Condition: Chronic respiratory diseases];